Which disease phenotype has the worst prognosis in Duchenne Muscular Dystrophy?

A strong association between the risk of cognitive disability and the involvement of groups of DMD isoforms was found.